Clinical trial inclusion criterion:
Male or female of aged 50 years or older

Annotated entities:
- Person: "Male"
- Person: "female"
- Person: "aged"
- Value: "50 years or older"